Clinical trial exclusion criterion:
Regular use of any nonsteroidal antiinflammatory drug,

Annotated entities:
- Multiplier: "Regular use"
- Condition: "nonsteroidal antiinflammatory drug"